What disease is associated with a Malar rash?

Malar rash is associated with a Systemic lupus erythematosus.